80歲老先生住在安養院，皮膚有一些丘疹，經皮膚科醫師診斷確定為疥瘡，下列敘述何者正確？
A. 有一無疥瘡病史的朋友，在探望老先生後第二天開始覺得全身發癢，其得到疥瘡機會很高
B. 頭部是疥蟲好犯的部位
C. 當疥蟲離開人體後，數個小時內就死亡
D. 鏡檢下，若只看到蟲卵或排泄物而不見蟲體，也可以確定是疥瘡感染

正確答案：D. 鏡檢下，若只看到蟲卵或排泄物而不見蟲體，也可以確定是疥瘡感染